下列何者是急性心肌梗塞後，發生猝死（Sudden death）最常見的原因？
A. 心臟破裂
B. 急性肺感染
C. 心室纖維顫動
D. 急性肺出血

正確答案：C. 心室纖維顫動